Clinical trial inclusion criterion:
Patients must be at least 18 years of age.

Entity relations:
- Has_value("age", "at least 18 years")